Had a history of, or ongoing, chronic or recurrent infectious disease

The above is a clinical trial exclusion criterion. Annotated with entity spans:
Had a [Temporal: history] of, or [Temporal: ongoing], [Qualifier: chronic] or [Qualifier: recurrent] [Condition: infectious disease]